Clinical trial exclusion criterion:
Major surgery within 1 month;

Entity relations:
- Has_value("Major surgery", "within 1 month")